Clinical trial exclusion criterion:
Patients receiving psychotropics of any kind, including betablockers and other anticonvulsants. Sleep medication such as oral chloral-hydrate or zopiclone are acceptable.

Annotated entities:
- Drug: "psychotropics"
- Drug: "betablockers"
- Drug: "anticonvulsants"
- Drug: "Sleep medication"
- Negation: "acceptable"
- Drug: "zopiclone"
- Drug: "chloral-hydrate"
- Qualifier: "oral"